Clinical trial exclusion criterion:
Use of Ginkgo biloba or St. John's Wort within 14 days before first dose of study drug

Annotated entities:
- Drug: "Ginkgo biloba"
- Drug: "St. John's Wort"
- Temporal: "within 14 days before first dose of study drug"
- Reference_point: "first dose of study drug"
- Multiplier: "first dose"
- Drug: "study drug"